En el procesamiento y presentación de péptidos de origen extracelular interviene (n):
1. Las proteínas TAP.
2. La tapasina.
3. La molécula HLA-DM.
4. El proteosoma.
5. Las moléculas HLA-B.

Respuesta correcta: 3. La molécula HLA-DM.